Patient unable to communicate or to understand the study

The above is a clinical trial exclusion criterion. Annotated with entity spans:
[Post-eligibility: Patient unable to communicate or to understand the study]